Clinical trial inclusion criterion:
Age 18 or above, or of legal age to give informed consent specific to state and national law

Annotated entities:
- Person: "Age"
- Value: "18 or above"
- Value: "of legal age"